下列何者不是造成高血鉀（hyperkalemia）之原因？
A. 急性腎衰竭（acute renal failure）
B. 慢性腎衰竭（chronic renal failure）
C. 橫紋肌溶解症（rhabdomyolysis）
D. 代謝性鹼中毒（metabolic alkalosis）

正確答案：D. 代謝性鹼中毒（metabolic alkalosis）